Clinical trial exclusion criterion:
Psychotic disorders (e.g., schizophrenia)

Entity relations:
- Subsumes("Psychotic disorders", "schizophrenia")